En un paciente trasplantado de hígado que está recibiendo inmunosupresión con tacrolimus, ¿cuál de los siguientes antibióticos incrementa de forma notable los niveles del inmunosupresor y por tanto debe evitarse?
1. Amoxicilina-clavulánico.
2. Ciprofloxacino.
3. Eritromicina.
4. Cefuroxima.
5. Norfloxacino.

Respuesta correcta: 3. Eritromicina.